Señale la respuesta correcta con respecto a la terapia para la depresión de Rehm:
1. Se centra sobre tres procesos: el autoseguimiento, la autoestima y el autorreforzamiento.
2. No tiene evidencia empírica para ser considerado tratamiento bien establecido.
3. Cada uno de sus componentes por separado se han mostrado igual de eficaces que el tratamiento completo.
4. Presenta un fuerte componente cognitivo.
5. Se ha mostrado superior a la terapia interpersonal y de solución de problemas.

Respuesta correcta: 3. Cada uno de sus componentes por separado se han mostrado igual de eficaces que el tratamiento completo.